Patient with record of congenital AAT deficiency of phenotype PiZZ (homozygote) or other rare phenotypes related to AAT deficiency and with AAT serum level ≤ 11 micromole. For patients receiving IV AAT augmentation therapy the serum AAT level threshold does not apply.

The above is a clinical trial inclusion criterion. Annotated with entity spans:
Patient with record of [Condition: congenital AAT deficiency of phenotype PiZZ (homozygote)] or other [Condition: rare phenotypes related to AAT deficiency] and with [Measurement: AAT serum level] [Value: ≤ 11 micromole]. [Context_Error: For patients receiving IV AAT augmentation therapy the serum AAT level threshold does not apply.]